En el proceso de cooperación Th2-B, ¿qué reconoce la célula Th2 en la superficie de la célula B?
1. El antígeno unido a una inmunoglobulina de superficie.
2. Un fragmento de antígeno unido a la molécula CD21.
3. Varios fragmentos de antígeno entrecruzados.
4. Un fragmento de antígeno unido a una molécula de histocompatibilidad de clase II.
5. Un fragmento de antígeno unido a una molécula de histocompatibilidad de clase I.

Respuesta correcta: 4. Un fragmento de antígeno unido a una molécula de histocompatibilidad de clase II.